patients with FEV1 / FVC <70%

The above is a clinical trial inclusion criterion. Annotated with entity spans:
patients with [Measurement: FEV1 / FVC] [Value: <70%]